Clinical trial inclusion criteria:
Subjects who the investigator believes can and will comply with the requirements of the protocol (i.e. return for follow-up visits, and able to converse with study personnel)
Age 18 years or older
Undergoing major cardiac surgery using cardiopulmonary bypass

Annotated entities:
- Post-eligibility: "Subjects who the investigator believes can and will comply with the requirements of the protocol (i.e. return for follow-up visits, and able to converse with study personnel"
- Person: "Age"
- Value: "18 years or older"
- Procedure: "major cardiac surgery"
- Procedure: "cardiopulmonary bypass"